Clinical trial inclusion criterion:
1. Male and female subjects must be 18 years of age or older and ambulatory.

Annotated entities:
- Person: "Male"
- Person: "female"
- Value: "18 years or older"
- Person: "age"
- Visit: "ambulatory"